Clinical trial exclusion criteria:
Any active respiratory, cardiovascular or other disease requiring regular treatment or being otherwise relevant for tolerance of hypoxia or altitude exposure.
Any condition that may interfere with protocol compliance including current heavy smoking (>20 cigarettes per day or >20 pack-years with active smoking during the last 10 years), regular use of alcohol.
Allergy to acetazolamide and other sulfonamides.

Annotated entities:
- Qualifier: "other"
- Condition: "disease"
- Condition: "cardiovascular disease"
- Condition: "respiratory disease"
- Qualifier: "active"
- Mood: "requiring"
- Procedure: "treatment"
- Mood: "relevant being"
- Condition: "tolerance"
- Condition: "hypoxia"
- Condition: "altitude exposure"
- Condition: "heavy smoking"
- Measurement: "cigarettes per day"
- Measurement: "pack-years"
- Condition: "active smoking"
- Temporal: "during the last 10 years"
- Value: ">20"
- Value: ">20"
- Condition: "regular use of alcohol"
- Condition: "Allergy"
- Drug: "acetazolamide"
- Drug: "sulfonamides"
- Qualifier: "other"